Clinical trial inclusion criterion:
Male participants between 18 and 40 years-old

Annotated entities:
- Person: "Male"
- Value: "between 18 and 40 years"
- Person: "old"